En comparación con las respuestas inmunitarias adaptativas, las innatas se caracterizan por:
1. Su notable especificidad.
2. Su gran diversidad.
3. Su memoria inmunológica.
4. Ser respuestas tempranas.

Respuesta correcta: 4. Ser respuestas tempranas.